Clinical trial inclusion criterion:
2. Patients with at least 1 ≥50% stenosis in a coronary vessel, subjected to FFR assessment, who exhibit variation in Pd / Pa ratio ≥ 0.05 (e.g. difference of max Pd/Pa minus min Pd/Pa) during steady state hyperaemia (determined by visual assessment).

Entity relations:
- Has_value("stenosis in a coronary vessel", "≥50%")
- Has_multiplier("stenosis in a coronary vessel", "at least 1")
- Has_value("Pd / Pa ratio", "≥ 0.05")
- Has_qualifier("hyperaemia", "steady state")
- AND("hyperaemia", "visual assessment")
- AND("variation in Pd / Pa ratio", "max Pd/Pa")
- AND("variation in Pd / Pa ratio", "min Pd/Pa")